冠狀動脈繞道手術後死亡病人的分析中，在某些族群病人的死亡率較一般病人來得高，但下列何種族群例外？
A. 女性病人
B. 糖尿病病人
C. 慢性腎衰竭病人
D. 肥胖症

正確答案：D. 肥胖症